En el genoma humano, las secuencias codificantes se denominan:
1. Exones.
2. Promotores.
3. Intensificadores.
4. Intrones.
5. Adaptadores.

Respuesta correcta: 1. Exones.